下列有關傳染性單核球增多症（Infectious mononucleosis）Epstein-Barr virus感染的敘述，何者最為正確？
A. 3歲以下的患者常有典型的疲倦、咽喉炎及淋巴結腫大
B. 90%以上患者會有抽筋或步態不穩等神經學症狀，因此治療要以類固醇為主
C. 若使用Ampicillin 常會引起皮疹
D. 主要感染的淋巴球是T淋巴球

正確答案：C. 若使用Ampicillin 常會引起皮疹